Clinical trial inclusion criteria:
Age =18 years
Subjects undergoing elective total knee or hip replacement or a revision of at least one component of a total knee or hip replacement

Annotated entities:
- Person: "Age"
- Value: "=18 years"
- Qualifier: "elective"
- Procedure: "total knee replacement"
- Procedure: "total hip replacement"
- Procedure: "a total knee replacement revision of"
- Qualifier: "at least one component"
- Procedure: "a hip replacement revision of"
- Temporal: "undergoing"